Clinical trial inclusion criterion:
Oxygen saturation < 90%

Entity relations:
- Has_value("Oxygen saturation", "< 90%")